Clinical trial exclusion criterion:
calculated creatinine clearance less than 60 mL per minute

Annotated entities:
- Measurement: "calculated creatinine clearance"
- Value: "less than 60 mL per minute"